Clinical trial exclusion criterion:
History of clinical typhoid fever, clinical paratyphoid A or B fever.

Annotated entities:
- Temporal: "History"
- Condition: "clinical typhoid fever"
- Condition: "clinical paratyphoid A fever"
- Condition: "clinical paratyphoid B fever"